Clinical trial exclusion criterion:
Subjects with a concurrent Axis II Cluster A Personality Disorder

Entity relations:
- Has_qualifier("Personality Disorder", "Axis II Cluster A")